The patient does not require treatment with aspirin or any other antiplatelet agent

The above is a clinical trial exclusion criterion. Annotated with entity spans:
The patient does [Negation: not] [Mood: require] [Procedure: treatment] with [Drug: aspirin] or any [Qualifier: other] [Drug: antiplatelet agent]